Clinical trial inclusion criterion:
Serum creatinine, ≤ 1.5x Institutional Upper Limit of Normal (ULN), or Creatinine Clearance ≥ 50 mL/min (by Cockcroft-Gault formula)

Annotated entities:
- Measurement: "Serum creatinine"
- Value: "≤ 1.5x Institutional Upper Limit of Normal (ULN)"
- Measurement: "Creatinine Clearance"
- Value: "≥ 50 mL/min"
- Qualifier: "Cockcroft-Gault formula"